Clinical trial exclusion criterion:
History of heart transplantation

Annotated entities:
- Procedure: "heart transplantation"